Clinical trial exclusion criterion:
Central + mixed apneas > 25% of the total apnea-hypopnea index (AHI)

Annotated entities:
- Condition: "mixed apneas"
- Condition: "Central apneas"
- Value: "> 25%"
- Measurement: "total apnea-hypopnea index"
- Measurement: "AHI"